Clinical trial inclusion criterion:
Planning neuraxial anesthesia

Annotated entities:
- Procedure: "neuraxial anesthesia"
- Mood: "Planning"